Clinical trial exclusion criterion:
Severe illness warranting hospital referral

Entity relations:
- Has_qualifier("illness", "Severe")
- Has_mood("hospital referral", "warranting")
- causal("hospital referral", "illness")